Clinical trial inclusion criterion:
Symptomatic: Baseline Dyspnea Index =8 and answer "in the morning" when asked about what time of day their COPD symptoms are worst.

Entity relations:
- Has_value("Baseline Dyspnea Index", "=8")
- Has_value("what time of day their COPD symptoms are worst", "in the morning")